Hospitalised children aged 3-mo to 5-yrs (in Darwin, children have to be Indigenous)

The above is a clinical trial inclusion criterion. Annotated with entity spans:
[Visit: Hospitalised] [Person: children] [Person: aged] [Value: 3-mo to 5-yrs] (in Darwin, children have to be Indigenous)